Clinical trial inclusion criterion:
Platelets >= 100,000/ul

Annotated entities:
- Measurement: "Platelets"
- Value: ">= 100,000/ul"